Clinical trial inclusion criterion:
Absolute neutrophil count (ANC) greater than or equal to 1.5 x 10^9/L without growth factor use in the 2 weeks before study randomization

Annotated entities:
- Measurement: "Absolute neutrophil count"
- Measurement: "ANC"
- Value: "equal to 1.5 x 10^9/L"
- Value: "greater than 1.5 x 10^9/L"
- Negation: "without"
- Observation: "growth factor use"
- Temporal: "in the 2 weeks before study randomization"
- Reference_point: "study randomization"